Clinical trial inclusion criterion:
a crown-rump length = 6mm and no cardiac activity OR

Annotated entities:
- Measurement: "crown-rump length"
- Value: "= 6mm"
- Negation: "no"
- Observation: "cardiac activity"